Clinical trial exclusion criterion:
Have, in the opinion of the investigator, evidence of alcohol, drug or solvent abuse.

Annotated entities:
- Condition: "alcohol abuse"
- Condition: "drug abuse"
- Condition: "solvent abuse"
- Non-representable: "in the opinion of the investigator"